Clinical trial exclusion criterion:
Present therapy with systemic steroids

Annotated entities:
- Procedure: "therapy"
- Temporal: "Present"
- Drug: "systemic steroids"